第八型人類疱疹病毒（Human herpesvirus 8）在愛滋病人可以引起何種淋巴瘤？
A. 濾泡性 B 細胞淋巴瘤
B. 體腔大 B 細胞淋巴瘤
C. 末梢 T 細胞淋巴瘤
D. 成人 T 細胞淋巴瘤

正確答案：B. 體腔大 B 細胞淋巴瘤